Clinical trial inclusion criterion:
South Australian secondary school students in years 10, 11, and 12 in 2017

Annotated entities:
- Observation: "secondary school students"
- Qualifier: "years 10"
- Qualifier: "years 11"
- Qualifier: "years 12"
- Temporal: "in 2017"
- Visit: "South Australian"